Clinical trial inclusion criterion:
Patients must have a Zubrod performance status of 0-2.

Entity relations:
- Has_value("Zubrod performance status", "0-2")